Clinical trial inclusion criterion:
No significant abnormalities in ECG per investigator judgment.

Entity relations:
- Has_qualifier("abnormalities in ECG", "significant")
- Has_negation("abnormalities in ECG", "No")
- AND("ECG", "abnormalities in ECG")